Hepatitis B, hepatitis C (excluding healthy carriers) or HIV positive

The above is a clinical trial exclusion criterion. Annotated with entity spans:
[Condition: Hepatitis B], [Condition: hepatitis C] ([Negation: excluding] [Condition: healthy carriers]) or [Condition: HIV positive]